下列何種疾病之病原菌非藉由節肢動物為傳播媒介？
A. 萊姆病（Lyme disease）
B. 梅毒（Syphilis）
C. 落磯山斑疹熱（Rocky mountain spotted fever）
D. 斑疹傷寒（Murine endemic typhus）

正確答案：B. 梅毒（Syphilis）